一個 6 歲大的男孩，雙股及兩側下肢出現紫斑及出血疹，男孩無發燒，精神良好，但右膝腫脹，全血球計量正常，最可能診斷為：
A. 原發性血小板過低紫斑症（idiopathic thrombocytopenic purpura）
B. 青年型類風濕性關節炎（juvenile rheumatoid arthritis）
C. 腦膜炎雙球菌敗血症（meningococcemia）
D. 類過敏性紫斑症 Henoch-Schönlein（anaphylactoid）purpura

正確答案：D. 類過敏性紫斑症 Henoch-Schönlein（anaphylactoid）purpura